Clinical trial inclusion criterion:
Male or female subjects, aged >=40 years. Females must be of Non Child Bearing Potential. The definition of Non Child Bearing Potential is as following: Females, regardless of their age, with functioning ovaries and who have a current documented tubal ligation or hysterectomy, or females who are post-menopausal.

Annotated entities:
- Value: ">=40 years"
- Person: "aged"
- Person: "Male"
- Person: "female"
- Person: "Females"
- Condition: "Child Bearing Potential"
- Negation: "Non"
- Condition: "Child Bearing Potential"
- Negation: "Non"
- Person: "Females"
- Condition: "functioning ovaries"
- Condition: "tubal ligation"
- Condition: "hysterectomy"
- Condition: "post-menopausal"
- Person: "females"